有關停經（menopause）的敘述，下列何者錯誤？
A. 有潮紅或發熱症狀
B. 血中 FSH、LH 及女性賀爾蒙降低
C. 心臟病的機會逐漸增加
D. 萎縮性陰道炎也是症狀之一

正確答案：B. 血中 FSH、LH 及女性賀爾蒙降低